Clinical trial inclusion criteria:
Patients with symptomatic persistent atrial fibrillation of less than 1-year duration.
Patients must be over 65 years old.
Patients give informed consent prior to participating in this study.

Annotated entities:
- Condition: "atrial fibrillation"
- Qualifier: "persistent"
- Qualifier: "symptomatic"
- Temporal: "less than 1-year"
- Person: "old"
- Value: "over 65 years"
- Informed_consent: "Patients give informed consent prior to participating in this study"